Participation in another clinical study

The above is a clinical trial exclusion criterion. Annotated with entity spans:
[Competing_trial: Participation in another clinical study]